What is the function of the ISW1 and CHD1 remodellers in yeast chromatin?

In vitro, the three known yeast nucleosome spacing enzymes (CHD1, ISW1 and ISW2) form arrays with different spacing.